Clinical trial exclusion criterion:
Age <18 years or >75 years

Annotated entities:
- Person: "Age"
- Value: "<18 years"
- Value: ">75 years"